新生兒由於子宮內生長遲滯（intrauterine growth retardation），腦部超音波（brain ultrasonography）檢查發現，有腦室週邊鈣化（periventricular calcification）與腦室擴大（ventriculomegaly）的異常，聽力篩檢亦出現異常。此新生兒最可能的診斷為：
A. congenital human parvovirus B19 infection
B. congenital rubella syndrome
C. congenital human herpes simplex virus infection
D. congenital cytomegalovirus infection

正確答案：D. congenital cytomegalovirus infection